BV+ by Amsel criteria and Nugent score OR history of BV in the prior 6 months

The above is a clinical trial inclusion criterion. Annotated with entity spans:
[Value: BV+] by [Measurement: Amsel criteria] and [Measurement: Nugent score] OR history of [Condition: BV] [Temporal: in the prior 6 months]